patients involved to other studies

The above is a clinical trial exclusion criterion. Annotated with entity spans:
[Competing_trial: patients involved to other studies]